有一位氣喘患者，每天白天皆有咳嗽與胸悶，且肺功能顯示 FEV1為 76%預期值，則下列何者為較不正確的藥物治療方式？
A. 低劑量吸入類固醇，加上吸入長效β2-agonist
B. 中劑量吸入類固醇，加上長效茶鹼（theophylline）
C. 中劑量吸入類固醇，加上長效口服β2-agonist
D. 長效茶鹼（theophylline），加上長效口服β2-agonist

正確答案：D. 長效茶鹼（theophylline），加上長效口服β2-agonist